Decompensated heart failure

The above is a clinical trial exclusion criterion. Annotated with entity spans:
[Condition: Decompensated heart failure]